當政府推動一種新的疫苗接種時，面對一些民眾對疫苗安全抱持疑慮。下列那一項不符合創新擴散成功的要件？
A. 相容性
B. 相對利益
C. 危害性
D. 成本效益

正確答案：C. 危害性